Clinical trial exclusion criterion:
Patient with left sided, colitis or pancolitis.

Entity relations:
- Has_qualifier("colitis", "left sided")
- OR("colitis", "pancolitis")